American Society of Anesthesiologists score (ASA) III or IV

The above is a clinical trial exclusion criterion. Annotated with entity spans:
[Measurement: American Society of Anesthesiologists score (ASA)] [Value: III] or [Value: IV]